信賴區間的寬度（the width of a confidence interval）不受下列那一項因素所影響？
A. 樣本數大小
B. 信賴水準的大小
C. 母群體受試者間的變異
D. 樣本平均值和母群體平均值間的差異

正確答案：D. 樣本平均值和母群體平均值間的差異